ASA physical status I-II

The above is a clinical trial inclusion criterion. Annotated with entity spans:
[Measurement: ASA physical status] [Value: I-II]